Use of inhaled or topical steroids are not an exclusion criteria.

The above is a clinical trial exclusion criterion. Annotated with entity spans:
[Non-representable: Use of inhaled or topical steroids are not an exclusion criteria.]